Clinical trial exclusion criterion:
Contraindications for MRI, including, but not limited to pacemaker, aneurysm clips, neurostimulators, cochlear implants, metal in eyes, steel worker, intra-uterine devices for birth control.

Annotated entities:
- Condition: "Contraindications"
- Procedure: "MRI"
- Negation: "not"
- Device: "pacemaker"
- Device: "aneurysm clips"
- Device: "neurostimulators"
- Device: "cochlear implants"
- Device: "metal"
- Qualifier: "eyes"
- Device: "steel worker"
- Device: "intra-uterine devices"